What is an operon?

An operon is a functioning unit of DNA containing a cluster of genes under the control of a single promoter.